Clinical trial exclusion criterion:
Children who are wards of the state, in foster care or police custody or detention will be excluded.

Annotated entities:
- Observation: "wards of the state"
- Observation: "foster care"
- Observation: "police custody"
- Observation: "detention"